68 歲男性，因右胸痛前來急診處就醫。理學檢查發現患者意識清楚，胸部聽診在右下肺葉處呼吸聲減少。胸部 X 光片顯示右下肺葉處有中量之胸水。抽胸水檢查發現為 exudate，cell count 4,500/mL， lymphocyte/neutrophil 之比值為 80/20，pH 為 6.9，glucose 為 50，下列何種處理最為適宜？
A. 因 pH＜7.0，懷疑肺炎併發膿胸迅速給予插胸管引流
B. 不插胸管引流，給予抗生素治療
C. 胸水做細胞學及嗜酸桿菌之相關檢查
D. 作支氣管鏡檢查

正確答案：C. 胸水做細胞學及嗜酸桿菌之相關檢查